下列何者是青光眼常見的視野變化？
A. 弓狀盲點（arcuate scotoma）
B. 兩眼顳側半盲（bitemporal hemianopsia）
C. 兩眼同側半盲（homonymous hemianopsia）
D. 中心盲點（central scotoma）

正確答案：A. 弓狀盲點（arcuate scotoma）